週期性健康檢查是預防保健的重要項目。下列有關疾病的檢查項目應納入週期性健康檢查範圍的敘述，何者錯誤？
A. 該疾病必須對健康有重要的影響
B. 該疾病應有相當的盛行率以符合成本效益
C. 該疾病應有有效的治療且早期治療比發病後治療有較佳的效果
D. 篩檢的方式由專科醫師決定以提高可信度

正確答案：D. 篩檢的方式由專科醫師決定以提高可信度